Clinical trial exclusion criteria:
Patients under 18
Pregnancy and Lactation
Patients allergic to polyglycolic / trimethylene carbonate
Carrier of prosthetic mesh in the ostomy
Patients presenting midline hernia.
Patients affected by inflammatory bowel disease

Annotated entities:
- Person: "under 18"
- Value: "under 18"
- Condition: "Pregnancy"
- Condition: "Lactation"
- Condition: "allergic"
- Drug: "polyglycolic carbonate"
- Drug: "trimethylene carbonate"
- Device: "prosthetic mesh"
- Procedure: "ostomy"
- Condition: "midline hernia"
- Condition: "inflammatory bowel disease"